Clinical trial inclusion criterion:
American society of anesthesiologist (ASA) physical status I or II

Annotated entities:
- Measurement: "American society of anesthesiologist physical status"
- Measurement: "ASA"
- Value: "I or II"